Progression on prior therapy with a hormonal agent if estrogen receptor or progesterone receptor positive, and/or with trastuzumab if HER2-neu positive. If patient has progressed through hormone or trastuzumab therapy only, must have received one chemotherapy regimen.

The above is a clinical trial inclusion criterion. Annotated with entity spans:
[Observation: Progression on] [Temporal: prior] [Procedure: therapy with a hormonal agent] if [Condition: estrogen receptor] or [Condition: progesterone receptor positive], and/or with trastuzumab if [Condition: HER2-neu positive]. If patient has [Observation: progressed through] [Procedure: hormone] or [Procedure: trastuzumab therapy] only, must have received one [Procedure: chemotherapy regimen].